Clinical trial inclusion criteria:
Bloodstream infection with Enterobacter spp., Serratia marcescens, Providencia spp., Morganella morganii or Citrobacter freundii (i.e. likely AmpC-producer), and susceptibility to 3rd generation cephalosporins (i.e. ceftriaxone, cefotaxime or ceftazidime), meropenem and piperacillin-tazobactam from at least one blood culture draw. This will be determined in accordance with laboratory methods and susceptibility breakpoints defined by protocols used in the recruiting site laboratories..
No more than 72 hours has elapsed since the first positive blood culture collection.
Patient is aged 18 years and over (>=21y in Singapore).

Annotated entities:
- Condition: "Bloodstream infection"
- Qualifier: "Enterobacter spp."
- Qualifier: "Serratia marcescens"
- Qualifier: "Providencia spp."
- Qualifier: "Morganella morganii"
- Qualifier: "Citrobacter freundii"
- Drug: "3rd generation cephalosporins ("
- Drug: "ceftriaxone"
- Drug: "cefotaxime"
- Drug: "ceftazidime"
- Drug: "meropenem"
- Drug: "piperacillin-tazobactam"
- Multiplier: "at least one"
- Measurement: "blood culture"
- Temporal: "No more than 72 hours since the first positive blood culture collection"
- Reference_point: "the first positive blood culture collection"
- Value: "positive"
- Measurement: "blood culture collection"
- Person: "aged"
- Value: "18 years and over"
- Value: ">=21y"
- Person: "Singapore"